List the core SNARE complex proteins.

VAMP2
Syntaxin
SNAP25